Clinical trial exclusion criterion:
contraindications from manufacturer for medications including currently taking haloperidol, artane, Phenergan (Promethazine), chlorpromazine, erythromycin, Azithromycin, clarithromycin, Ketoconazole, fluconazole, mefloquine (as prophylaxis), lumefantrine (in Coartem), quinine, Septrin

Entity relations:
- AND("lumefantrine", "Coartem")
- Subsumes("Phenergan", "Promethazine")
- AND("contraindications", "haloperidol")
- OR("haloperidol", "artane", "Phenergan", "chlorpromazine", "erythromycin", "Azithromycin", "clarithromycin", "Ketoconazole", "fluconazole", "mefloquine", "Septrin", "quinine", "lumefantrine")